Male or female patients age 18 years or older, with relapsed or refractory sALCL who have previously received at least 1 multiagent chemotherapy

The above is a clinical trial inclusion criterion. Annotated with entity spans:
[Person: Male] or [Person: female] patients [Person: age] [Value: 18 years or older], with [Qualifier: relapsed] or [Qualifier: refractory] [Condition: sALCL] who have previously received [Multiplier: at least 1] multiagent [Procedure: chemotherapy]